En comparación con las respuestas humorales primarias, las secundarias:
1. Están basadas fundamentalmente en IgM.
2. Son más rápidas y duraderas.
3. Generan anticuerpos de baja afinidad por el antígeno.
4. Presentan un bajo nivel de hipermutación.
5. Generan mucha menor cantidad de anticuerpos.

Respuesta correcta: 2. Son más rápidas y duraderas.